頸動脈竇（carotid sinus）與頸動脈體（carotid body）是一壓力接受器（baroreceptor）與化學接受器 （chemoreceptor）位在總頸動脈分叉處，其訊息經由那一條神經傳入頭部？
A. 舌咽神經（Glossopharyngeal nerve）
B. 頸襻（Ansa cervicalis）
C. 副神經（Accessory nerve）
D. 舌下神經（Hypoglossal nerve）

正確答案：A. 舌咽神經（Glossopharyngeal nerve）